Actively trying to achieve pregnancy

The above is a clinical trial exclusion criterion. Annotated with entity spans:
[Pregnancy_considerations: Actively trying to achieve pregnanc]y